Newly-diagnosed or recurrent (local, regional, metastatic) malignant melanoma or breast cancer patients in whom SLN mapping is indicated

The above is a clinical trial inclusion criterion. Annotated with entity spans:
[Temporal: Newly-diagnosed] or [Multiplier: recurrent] ([Qualifier: local], [Qualifier: regional], [Qualifier: metastatic]) [Condition: malignant melanoma] or [Condition: breast cancer] patients in whom SLN mapping is indicated